Clinical trial exclusion criterion:
any prior adverse response to lisdexamfetamine dimesylate or other stimulant medication

Annotated entities:
- Temporal: "prior"
- Condition: "adverse response"
- Drug: "lisdexamfetamine dimesylate"
- Qualifier: "other"
- Drug: "stimulant medication"